Clinical trial exclusion criterion:
No antiangiogenic concomitant treatment, 15 days before and 15 days after radioembolization, including Sorafenib

Entity relations:
- Has_negation("antiangiogenic treatment", "No")
- Has_temporal("antiangiogenic treatment", "15 days before radioembolization")
- Has_temporal("antiangiogenic treatment", "15 days after radioembolization")
- Subsumes("antiangiogenic treatment", "Sorafenib")